Patients unable to give informed consent.

The above is a clinical trial exclusion criterion. Annotated with entity spans:
[Informed_consent: Patients unable to give informed consent].